下列何者不是漿細胞（plasma cell）的特徵？
A. 具車輪狀核
B. 細胞核偏一邊
C. 細胞質含許多粗糙內質網
D. 細胞質含許多平滑內質網

正確答案：D. 細胞質含許多平滑內質網